Usted valora a un paciente de 66 años con dolor inguinal acentuado con la bipedestación prolongada algunos días al mes. Una radiografía simple de caderas muestra estrechamiento del espacio articular femoro-acetabular, esclerosis y ostefitos. ¿Cuál es su actitud?
1. Hago el diagnóstico de coxartrosis y envío al traumatólogo para colocar una prótesis de cadera.
2. Inicio tratamiento con opioides débiles que han demostrado evidencia en detener la progresión de la enfermedad.
3. Instauro tratamiento con paracetamol, explico que la evolución es muy variable y la indicación quirúrgica depende de la funcionalidad y control del dolor.
4. Por las características radiológicas descritas, necesito una RMN de cadera antes de tomar una decisión terapéutica.

Respuesta correcta: 3. Instauro tratamiento con paracetamol, explico que la evolución es muy variable y la indicación quirúrgica depende de la funcionalidad y control del dolor.